腫瘤細胞缺乏下列何種分子時，NK細胞有更好的毒殺腫瘤細胞能力？
A. MHC class I
B. MHC class II
C. T1
D. HER-2/neu

正確答案：A. MHC class I